Clinical trial exclusion criterion:
Intent to withdraw advanced life support as per the ICU physician;

Annotated entities:
- Non-query-able: "Intent to withdraw advanced life support as per the ICU physician"